Clinical trial exclusion criterion:
5. Abnormal and clinically significant laboratory test results:

Annotated entities:
- Parsing_Error: "5."
- Parsing_Error: "Abnormal and clinically significant laboratory test results:"
- Subjective_judgement: "Abnormal and clinically significant laboratory test results:"